Clinical trial exclusion criterion:
HAs of any kind of moderate or severe intensity on an average of more than 2 days per month preceding the concussive trauma

Entity relations:
- Has_multiplier("HAs", "average of more than 2 days per month")
- Has_temporal("HAs", "preceding the concussive trauma")
- Has_qualifier("HAs", "moderate or severe intensity")